Presence of dental prostheses.

The above is a clinical trial exclusion criterion. Annotated with entity spans:
Presence of [Device: dental prostheses].